Clinical trial inclusion criterion:
Patients aged =50 years with DM2 and symptomatic PAD diagnosed clinically (according to Fontaine criteria, stage IIa or IIb and III) and by measuring the <U+0391><U+0392><U+0399>.

Entity relations:
- Has_value("aged", "=50 years")
- Has_qualifier("PAD", "symptomatic")
- Has_value("Fontaine criteria", "stage IIa or IIb and III")
- AND("PAD", "Fontaine criteria")